¿En qué casos de rechazo escolar debe realizarse el diagnóstico de Fobia específica?:
1. Cuando el miedo, la ansiedad o la evitación sea persistente y dure 6 meses o más.
2. Cuando el rechazo a acudir a la escuela sea persistente y genere malestar clínicamente significativo o deterioro en los social, académico o familiar.
3. Siempre que no se deba a un trastorno de ansiedad por separación.
4. En aquellos en los que el estímulo fóbico sea un aspecto concreto del contexto escolar.

Respuesta correcta: 4. En aquellos en los que el estímulo fóbico sea un aspecto concreto del contexto escolar.